Clinical trial exclusion criterion:
hypoglycemia SE;psychogenic SE;any other pseudo-SE

Entity relations:
- OR("hypoglycemia SE", "psychogenic SE", "pseudo-SE")